Clinical trial exclusion criterion:
Prior medical or surgical management of this gestation

Entity relations:
- AND("medical management", "gestation")
- AND("surgical management", "gestation")
- OR("medical management", "surgical management")